下列有關鎮靜-催眠（sedative-hypnotic）藥物作用之描述，何者正確？
A. benzodiazepines 類藥物較 barbiturates 類藥物容易引起呼吸抑制的副作用
B. barbiturates 類藥物會直接打開 GABAA 受體氯離子管道，但 benzodiazepines 類藥物則否
C. 鎮靜-催眠藥物與酒精不會彼此間產生交互依賴性（cross-dependence）的現象
D. 長效型藥物在停藥後所產生的戒斷現象（withdrawal symptoms）通常較短效型藥物嚴重

正確答案：B. barbiturates 類藥物會直接打開 GABAA 受體氯離子管道，但 benzodiazepines 類藥物則否